Clinical trial inclusion criterion:
Non-radicular pain. Patients will be excluded if the pain radiates below the gluteal folds in a radicular pattern.

Annotated entities:
- Negation: "Non"
- Qualifier: "radicular"
- Condition: "pain"
- Negation: "excluded"
- Condition: "pain"
- Qualifier: "below the gluteal folds in a radicular pattern"